Horner's Syndrome

The above is a clinical trial inclusion criterion. Annotated with entity spans:
[Condition: Horner's Syndrome]